Clinical trial exclusion criterion:
No lesion should be included when more than 50% of the lesion is further down than 4 cm beneath the skin level.

Annotated entities:
- Condition: "lesion"
- Multiplier: "more than 50% of the lesion"
- Value: "further down than 4 cm"
- Measurement: "beneath the skin level"